Heart Team assessment of operability (the heart team considers the patient to be a good surgical candidate).

The above is a clinical trial exclusion criterion. Annotated with entity spans:
[Procedure: Heart Team assessment of operability] (the [Condition: heart team considers the patient to be a good surgical candidate]).